Clinical trial exclusion criterion:
Erythropoietin or IV iron in the previous 4 weeks

Annotated entities:
- Drug: "Erythropoietin"
- Drug: "IV iron"
- Temporal: "in the previous 4 weeks"